Clinical trial exclusion criterion:
risk of harm to self or others that requires immediate intervention

Annotated entities:
- Non-query-able: "risk of harm to self or others that requires immediate intervention"